Scheduled to undergo surgery for primary solid organ cancer under general anesthesia, with an expected duration of surgery >=2 hours;

The above is a clinical trial inclusion criterion. Annotated with entity spans:
[Mood: Scheduled] to undergo [Procedure: surgery] for [Qualifier: primary] [Condition: solid organ cancer] under [Procedure: general anesthesia], [Non-representable: with an expected duration of surgery >=2 hours;]